在中樞神經系統，髓鞘是由那種細胞所構成？
A. 微小膠細胞
B. 寡樹突膠細胞
C. 星狀膠細胞
D. 室管膜細胞

正確答案：B. 寡樹突膠細胞